Clinical trial exclusion criterion:
Use of antidepressant medication within 1 month of the pre-treatment PET scan (within 5 weeks for fluoxetine and protryptyline).

Annotated entities:
- Drug: "antidepressant medication"
- Temporal: "within 1 month of the pre-treatment PET scan"
- Reference_point: "pre-treatment PET scan"
- Temporal: "within 5 weeks for fluoxetine and protryptyline"
- Reference_point: "fluoxetine and protryptyline"
- Procedure: "PET scan"
- Drug: "fluoxetine"
- Drug: "protryptyline"
- Temporal: "pre-treatment"